Clinical trial exclusion criterion:
History of recurrent respiratory infections (> 3 hospitalization in the last year)

Annotated entities:
- Condition: "respiratory infections"
- Multiplier: "recurrent"
- Temporal: "History"
- Multiplier: "> 3 in the last year"
- Procedure: "hospitalization"